51 歲婦女，因為偶發性右腰痛（colic pain），到泌尿科門診接受腎盂輸尿管的檢查，發現在輸尿管中段有 一顯影劑缺損（filling defect），造成右邊輸尿管水腫以及輕微腎水腫。此時醫院廣播，鼓勵四癌篩檢的衛
 教，所以這位婦女也接受子宮頸抹片的檢查。但是一週後，抹片報告為鱗狀上皮癌（squamous cell carcinoma）。這位婦女接下來的，應優先考慮下列何步驟？
A. 抹片可能是偽陽性，可以不管，3個月後再做一次抹片或人類乳突病毒檢查
B. 初期的子宮頸癌，要接受全子宮根除性手術治療
C. 晚期的子宮頸癌，建議去放射腫瘤科接受化療同步的放射線治療
D. 接受陰道鏡輔助的子宮頸切片檢查或直接子宮頸切片檢查

正確答案：D. 接受陰道鏡輔助的子宮頸切片檢查或直接子宮頸切片檢查